Clinical trial exclusion criterion:
Previous bypass surgery or stenting of the superficial femoral artery

Entity relations:
- Has_temporal("bypass surgery", "Previous")
- Has_temporal("stenting of the superficial femoral artery", "Previous")
- OR("bypass surgery", "stenting of the superficial femoral artery")